Clinical trial exclusion criterion:
Use of medications that interact with contraceptive steroid hormones: anti-epileptic medications, rifampin, rifabutin, fosamprenavir, etc

Annotated entities:
- Drug: "medications"
- Observation: "interact with"
- Drug: "contraceptive steroid hormones"
- Drug: "anti-epileptic medications"
- Drug: "rifampin"
- Drug: "rifabutin"
- Drug: "fosamprenavir"